下列何種病毒對脂溶劑（如乙醚）具抗性？
A. 痘病毒（Poxvirus）
B. 疱疹病毒（Herpesvirus）
C. 腺病毒（Adenovirus）
D. 反轉錄病毒（Retrovirus）

正確答案：C. 腺病毒（Adenovirus）